根據DSM-IV-TR，有關身體化症（somatoform disorder）的敘述，下列何者正確？
A. 身體畸形性疾患（body dysmorphic disorder）好發於15至30歲女性，且患者關注焦點通常	重在臉部缺陷（facial flaws）
B. 身體化疾患（somatization disorder）較常發生於教育程度高或社經階層較高者
C. 慮病症（hypochondriasis）通常女性較多，且與社經階層及教育程度相關
D. 在疼痛疾患（pain disorder）中，急性疼痛最常與憂鬱疾患（depressive disorder）共病，而慢性疼痛則較常與焦慮性疾患

正確答案：A. 身體畸形性疾患（body dysmorphic disorder）好發於15至30歲女性，且患者關注焦點通常	重在臉部缺陷（facial flaws）